Clinical trial exclusion criterion:
2. Patients who received ATG, Campath, or other T cell immunosuppressive monoclonal antibodies in the last 28 days

Entity relations:
- Has_temporal("ATG", "in the last 28 days")
- OR("ATG", "Campath", "T cell immunosuppressive monoclonal antibodies")